Significant (as defined by the PI) intolerance of presently-used DMT

The above is a clinical trial exclusion criterion. Annotated with entity spans:
[Qualifier: Significant] (as defined by the PI) [Condition: intolerance] of [Temporal: presently-used] [Drug: DMT]